Clinical trial exclusion criterion:
Poor performance status

Entity relations:
- Has_value("performance status", "Poor")